下列對於 RNA polymerase 之敘述何者錯誤？
A. 在真核細胞中有三大類
B. 在轉錄過程中 RNA polymerase 需要 primer 來進行 RNA 合成
C. Cycloheximide 不能抑制它的活性
D. 在原核細胞中需要 sigma 因子來辨識啟動子（promoter）

正確答案：B. 在轉錄過程中 RNA polymerase 需要 primer 來進行 RNA 合成